Clinical trial inclusion criterion:
Only patients with atrial fibrillation, above 18 years, and with TTR <50% based on the last three values of INR will be included in this study.

Annotated entities:
- Condition: "atrial fibrillation"
- Value: "above 18 years"
- Person: "years"
- Measurement: "TTR"
- Value: "<50%"
- Qualifier: "based on the last three values of INR"